What happens to retrotransposons during ageing?

Retrotransposons are activated as organisms age